Hombre de 80 años, con antecedentes de HTA, cardiopatía isquémica y EPOC, al que se le realiza una rectocolonoscopia completa por presentar rectorragia, con los siguientes hallazgos: lesión polipoidea de 3 cm de diámetro situada a 10 cm del margen anal, que ocupa la mitad de la circunferencia. Resto de exploración sin hallazgos hasta ciego. En la biopsia del pólipo se aprecia un adenocarcinoma limitado a la submucosa. Ecografia endorrectal: uT1N0. RM pélvica: T1N0. TC: Sin evidencia de enfermedad a distancia. ¿Cuál será la decisión terapeutica más probable que se tome en la Comisión Multidisciplinar de Tumores?
1. Amputación abdomino-perineal de recto.
2. Radioterapia neoadyuvante y resección anterior baja de recto por vía laparoscópica.
3. Microcirugía transanal endoscópica.
4. Resección anterior baja de recto vía laparotómica.
5. Resección anterior baja de recto vía laparoscópica y radioterapia adyuvante.

Respuesta correcta: 3. Microcirugía transanal endoscópica.